La mayoría de los linfocitos T reguladores:
1. Son CD8+.
2. Expresan niveles altos de CD25.
3. Expresan niveles altos de IL-7.
4. Suelen expresar cantidades bajas de CTLA4.

Respuesta correcta: 2. Expresan niveles altos de CD25.